Which are the main features of CREST and other ALS-linked proteins?

Like several other ALS-associated proteins, CREST is recruited to induced stress granules.